Clinical trial exclusion criterion:
History of severe mental illness (as their experience of symptoms may already be altered)

Entity relations:
- Has_qualifier("mental illness", "severe")